Women who had regular cycles until at least age 40 and at least one child

The above is a clinical trial inclusion criterion. Annotated with entity spans:
[Person: Women] [Condition: who had regular cycles until at least age 40] and at least one child